下列何者不是嬰兒期水腦（Infantile hydrocephalus）的病徵之一？
A. 頭圍增大
B. 囟門膨出
C. 頭皮靜脈擴大
D. 眼球可見"朝陽眼（sun-rising eye）＂

正確答案：D. 眼球可見"朝陽眼（sun-rising eye）＂